Clinical trial exclusion criterion:
Patients who are planning to receive mycophenolate instead of everolimus

Entity relations:
- Has_negation("everolimus", "instead of")
- AND("mycophenolate", "everolimus")
- Has_mood("mycophenolate", "planning to")